Clinical trial inclusion criterion:
Normal renal function (defined as serum creatinine level <133 µmol/L and Estimated Glomerular Filtration Rate (eGFR) greater than or equal to 60)

Entity relations:
- Has_value("Estimated Glomerular Filtration Rate (eGFR)", "greater than or equal to 60")
- Has_value("serum creatinine level", "<133 µmol/L")
- Subsumes("Normal renal function", "serum creatinine level")
- Subsumes("Normal renal function", "Estimated Glomerular Filtration Rate (eGFR)")